History of malignancy;

The above is a clinical trial exclusion criterion. Annotated with entity spans:
History of [Condition: malignancy];